Pregnant, breast-feeding women or women who plan to become pregnant during this study (Females of childbearing potential must have a negative urine pregnancy test)

The above is a clinical trial exclusion criterion. Annotated with entity spans:
[Condition: Pregnant], [Condition: breast-feeding] [Person: women] or [Person: women] who [Non-query-able: plan to become] [Condition: pregnant] [Temporal: during this study] ([Person: Females] of [Condition: childbearing potential] must have a [Value: negative] [Measurement: urine pregnancy test])